Clinical trial exclusion criterion:
Significant illness within the two weeks prior to dosing.

Entity relations:
- Has_temporal("Significant illness", "within the two weeks prior")